胡先生62歲患有	病、高血壓於心臟科門診追蹤治療，主訴兩小時前開始嚴重上腹悶痛合併冒冷	及嘔 吐，在急診測得之心跳每分鐘約為52下，血壓為80/50 mmHg，頸靜脈鼓張，經診斷為急性心肌梗塞，下列何者心電圖變化最不可能和其診斷相關？
A. ST elevation在lead II, III, aVF
B. ST depression在lead V1, V2
C. ST elevation在lead V4R
D. PR segment depression

正確答案：D. PR segment depression